Clinical trial exclusion criterion:
Kellgren-Lawrence score at X-ray evaluation > 3;

Entity relations:
- AND("X-ray evaluation", "Kellgren-Lawrence score")
- Has_value("Kellgren-Lawrence score", "> 3")